Dentro de los testículos los espermatozoides son producidos en:
1. El epidídimo.
2. El conducto deferente.
3. La túnica albugínea.
4. Túbulos seminíferos.

Respuesta correcta: 4. Túbulos seminíferos.